Haemoglobin ≥ 9g/dL.

The above is a clinical trial inclusion criterion. Annotated with entity spans:
[Measurement: Haemoglobin] [Value: ≥ 9g/dL].